一位 68 歲男性，罹患慢性阻塞性肺疾多年，近日咳嗽及呼吸困難加劇前往急診處就醫。身體診查發現患者意識清楚，呼吸急促，及胸部聽診有呼氣喘鳴聲。胸部 X 光片沒有肺炎之現象，其呼吸空氣時動 脈血液氣體分析顯示 pH 7.274，PaCO2 78 mmHg，PaO2 40 mmHg，HCO3- 36 mEq/L，BE +9 mEq/L。
 給予氧氣後，下列何者為最優先且適當之處置？
A. 迅速給予氣管內插管及使用呼吸器以改善急性呼吸衰竭
B. 給予重碳酸鈉輸液來改善酸血症
C. 給予支氣管擴張劑吸入治療，並考慮使用非侵襲性呼吸器治療
D. 給予口服類固醇治療

正確答案：C. 給予支氣管擴張劑吸入治療，並考慮使用非侵襲性呼吸器治療